Para analizar los sitios de unión de proteínas al DNA se utiliza la técnica de:
1. Western blot.
2. Inmunoprecipitación de la cromatina.
3. Desorción láser asistido por matriz (MALDI).
4. Huella dactilar.
5. Electroforesis en gel desnaturalizante.

Respuesta correcta: 2. Inmunoprecipitación de la cromatina.